以 ursodeoxycholic acid 治療膽結石之最常見副作用為：
A. 黃疸
B. 腎衰竭
C. 貧血
D. 腹瀉

正確答案：D. 腹瀉